Clinical trial inclusion criteria:
male patients with androgenetic alopecia between 18 years and 60 years

Annotated entities:
- Person: "male"
- Condition: "androgenetic alopecia"
- Value: "between 18 years and 60 years"
- Person: "years"